有關歐美乳癌死亡率下降歸功的原因，下列何者錯誤？
A. breast self examination
B. mammography screening
C. adjuvant hormonal therapy
D. adjuvant chemotherapy

正確答案：A. breast self examination